Clinical trial exclusion criterion:
HBV treatment ongoing at the day of inclusion

Annotated entities:
- Procedure: "HBV treatment"